Clinical trial exclusion criterion:
Subjects (females) with active sexual life that do not use a contraceptive method.

Annotated entities:
- Person: "females"
- Observation: "active sexual life"
- Negation: "not"
- Procedure: "contraceptive method"